Clinical trial inclusion criterion:
English or Spanish speaking*

Annotated entities:
- Observation: "English speaking"
- Observation: "Spanish speaking"